78 歲男性，最近三個星期於軀幹及上下肢發生數個大水疱。皮膚病理檢查顯現表皮下裂解，且有嗜伊紅性細胞浸潤於真皮上層。最可能的診斷為：
A. 帶狀疱疹（herpes zoster）
B. 膿痂疹（impetigo）
C. 類天疱瘡（pemphigoid）
D. 天疱瘡（pemphigus）

正確答案：C. 類天疱瘡（pemphigoid）